Patient with health coverage

The above is a clinical trial inclusion criterion. Annotated with entity spans:
Patient with [Observation: health coverage]